Clinical trial inclusion criterion:
Ambulatory (defined as able to ambulate at least 10 meters, with or without assistance).

Annotated entities:
- Person: "Ambulatory"
- Non-query-able: "defined as able to ambulate at least 10 meters, with or without assistance"